Clinical trial exclusion criterion:
Clinically significant cardiac arrhythmia or other cardiac disease (including congestive heart failure), uncontrolled diabetes mellitus, clinically significant respiratory disease, or known immunosuppression

Entity relations:
- Has_qualifier("diabetes mellitus", "uncontrolled")
- Has_qualifier("respiratory disease", "clinically significant")
- Subsumes("cardiac disease", "congestive heart failure")
- OR("cardiac arrhythmia", "respiratory disease", "diabetes mellitus", "cardiac disease", "immunosuppression")